Less than 2-year disease free from another primary malignancy (other than squamous or basal cell carcinoma of the skin, "in-situ" carcinoma of the cervix or breast, superficial bladder carcinoma, or previously treated localized prostate cancer with normal prostate specific antigen (PSA) levels). Patients who have had completed all anti-cancer treatment for another primary malignancy more than 2 years prior to screening are eligible if they are not considered to have a "currently active" malignancy based on having less than a 30% risk of relapse.

The above is a clinical trial exclusion criterion. Annotated with entity spans:
[Temporal: Less than 2-year] [Condition: disease free] from [Qualifier: another] [Condition: primary malignancy] ([Negation: other than] [Condition: squamous or basal cell carcinoma of the skin], [Condition: "in-situ" carcinoma of the cervix] or breast, [Condition: superficial bladder carcinoma], or previously treated [Condition: localized prostate cancer] with [Value: normal] [Measurement: prostate specific antigen (PSA) levels]). Patients who have had completed all [Procedure: anti-cancer treatment] for [Qualifier: another] [Condition: primary malignancy] [Temporal: more than 2 years prior] to [Reference_point: screening] [Negation: are eligible] if they are not considered to have a "currently active" malignancy based on having less than a 30% risk of relapse.